Clinical trial inclusion criterion:
Patients with a life expectancy of greater than 1 year

Entity relations:
- Has_value("life expectancy", "greater than 1 year")